En circunstancias en las que el paciente puede participar en el proceso de toma de decisiones sobre su atención, se ha observado que:
1. Se reduce su confianza sobre la competencia del profesional.
2. Aumenta la adherencia del paciente al tratamiento.
3. Disminuye la adherencia del paciente al tratamiento.
4. Aumenta la confianza sobre la competencia del profesional.

Respuesta correcta: 2. Aumenta la adherencia del paciente al tratamiento.